楊同學騎機車發生車禍導致嚴重腦傷，目前仍意識紊亂，記憶喪失，常有躁動現象。依照 Rancho Los  Amigos 量表來評分，應該屬於第幾級？
A. III
B. IV
C. V
D. VI

正確答案：B. IV